Clinical trial inclusion criterion:
Has Barcelona Clinic Liver Cancer (BCLC) Stage C disease or BCLC Stage B disease not amenable to locoregional therapy or refractory to locoregional therapy and not amenable to a curative treatment approach

Entity relations:
- Has_value("Barcelona Clinic Liver Cancer (BCLC)", "Stage C")
- Has_value("BCLC", "Stage B")
- Has_negation("amenable to a curative treatment approach", "not")
- AND("disease", "Barcelona Clinic Liver Cancer (BCLC)")
- AND("disease", "BCLC")
- Has_qualifier("disease", "amenable to locoregional therapy")
- Has_qualifier("disease", "amenable to a curative treatment approach")
- OR("not", "amenable to locoregional therapy")
- OR("amenable to locoregional therapy", "refractory to locoregional therapy")
- OR("disease", "disease")